Clinical trial exclusion criterion:
Cases (with a history of TBI):

Annotated entities:
- Parsing_Error: "Cases (with a history of TBI):"